病人因視力模糊至眼科就診，眼科醫師檢查視野有缺陷，並接受 MRI 檢查，根據此 MRI 診斷出右側枕葉有梗塞，病人最可能產生那一種視野缺陷？
A. Bitemporal hemianopsia
B. Right side homonymous hemianopsia
C. Left side homonymous hemianopsia
D. Central scotoma

正確答案：C. Left side homonymous hemianopsia